Clinical trial exclusion criterion:
Regular use of anti-inflammatory drugs.

Annotated entities:
- Drug: "anti-inflammatory drugs"